Clinical trial exclusion criterion:
Known hypersensitivity to PPI

Annotated entities:
- Condition: "hypersensitivity"
- Drug: "PPI"